Concomitant use of NSAIDS, ASA, and other anticoagulants.

The above is a clinical trial exclusion criterion. Annotated with entity spans:
[Temporal: Concomitant] use of [Drug: NSAIDS], [Drug: ASA], and [Qualifier: other] [Drug: anticoagulants].